下列有關瀕死癌末病人因為意識不清，無法再進食時的營養處置，何者最正確？
A. 馬上接上全靜脈營養（total parenteral nutrition），以防營養不足
B. 立即插上鼻胃管，以防營養不足
C. 與家屬討論給與人工營養水分的利弊得失
D. 建議病人接受經皮內視鏡胃造口術（percutaneous endoscopic gastrostomy）

正確答案：C. 與家屬討論給與人工營養水分的利弊得失